Which is the role of mediator in genome organization?

mediator binds to boundaries of chromosomal interaction domains and to proteins involved in dna looping, rna metabolism, chromatin remodeling, and actin assembly.. mediator is a multi-unit molecular complex that plays a key role in transferring signals from transcriptional regulators to rna polymerase ii in eukaryotes.